Clinical trial inclusion criterion:
Presence of measurable lesions (=10mm on spiral CT scan) subject to RECIST 1.1;

Entity relations:
- Has_value("spiral CT scan", "=10mm")
- AND("measurable lesions", "spiral CT scan")
- Has_qualifier("measurable lesions", "RECIST 1.1")